La tularemia es una zoonosis causada por una especie del género:
1. Frankia.
2. Francisella.
3. Enterococcus.
4. Streptococcus.

Respuesta correcta: 2. Francisella.